王小姐 35 歲，於 1 週前在左側乳房摸到 1 個腫塊，初步檢查後接受了腫塊的組織穿刺檢查，病理化驗報告為 ductal carcinoma in situ（DCIS）。你於門診告知其結果後，王小姐與你進一步討論相關的問題與治療計畫。下列敘述何者錯誤？
A. 王小姐的乳房攝影檢查發現左側乳房有廣泛性的群聚微鈣化點（clustered microcalcification），可能手術切除腫塊組織的邊緣難以乾淨無虞（clear margin），治療可能需要做乳房全切除術
B. 王小姐除了 DCIS 外，也有合併侵襲性癌（invasive carcinoma）的可能，手術可以選擇加入前哨淋巴結（sentinel node）切片手術
C. DCIS 表示癌細胞還在基底膜內沒有侵犯組織，在組織型態上可歸為數類。其中屬於乳突型（papillary type）者轉變為侵襲癌的過程進展快速，惡性度高，如果屬於面皰型（comedo type）者，則相對轉變為侵襲癌的過程較緩慢
D. DCIS 患者術後接受 tamoxifen 的治療，目前臨床試驗（如 NSABPB-24 trial）的結果，對側乳房發生乳癌的風險可顯著降低

正確答案：C. DCIS 表示癌細胞還在基底膜內沒有侵犯組織，在組織型態上可歸為數類。其中屬於乳突型（papillary type）者轉變為侵襲癌的過程進展快速，惡性度高，如果屬於面皰型（comedo type）者，則相對轉變為侵襲癌的過程較緩慢